Contiene azufre la cadena lateral de:
1. Lisina.
2. Triptófano.
3. Cisteína.
4. Serina.
5. Alanina.

Respuesta correcta: 3. Cisteína.